Heart failure requiring loop diuretics

The above is a clinical trial exclusion criterion. Annotated with entity spans:
[Condition: Heart failure] requiring [Drug: loop diuretics]